對 100 名國小六年級學童測量體重，發現樣本平均值為 35 公斤，母群體平均值的 95% 信賴區間為 33 公斤至 37 公斤。下列敘述何者正確？
A. 母群體平均值為 35 公斤
B. 該研究 100 名國小學童中，95 名的體重介在 33 至 37 公斤之間
C. 該樣本學童的體重標準差約為 10 公斤
D. 若計算母群體平均值的 90% 信賴區間，其範圍會大於 95% 信賴區間

正確答案：C. 該樣本學童的體重標準差約為 10 公斤